下列關於 Nocardia species 的敘述，何者錯誤？
A. 格蘭氏染色呈格蘭氏陽性球菌
B. 在細胞免疫缺損的病人可能引起全身感染，包括腦膿瘍
C. 在健康宿主可能因接觸土壤或植物而感染皮膚淋巴型的疾病
D. 首選藥物是磺胺類，譬如 trimethoprim-sulfamethoxazole

正確答案：A. 格蘭氏染色呈格蘭氏陽性球菌